Clinical trial exclusion criterion:
Has had prior systemic therapy for HCC in the advanced (incurable) setting other than sorafenib or oxaliplatin-based chemotherapy, prior to start of study medication

Entity relations:
- AND("systemic therapy", "HCC")
- Has_qualifier("chemotherapy", "sorafenib or oxaliplatin-based")
- Has_index("prior", "start of study medication")
- Has_temporal("systemic therapy", "prior")
- Has_negation("chemotherapy", "other than")
- AND("systemic therapy", "chemotherapy")
- Has_temporal("sorafenib", "prior")
- Has_temporal("oxaliplatin", "prior")